Clinical trial exclusion criterion:
History of exposure to the following cumulative doses of anthracyclines: Doxorubicin or liposomal doxorubicin > 500 mg/m^2; epirubicin > 900 mg/m^2; mitoxantrone > 120mg/m^2 and idarubicin > 90 mg/m^2.

Entity relations:
- Has_multiplier("idarubicin", "> 90 mg/m^2")
- Has_multiplier("mitoxantrone", "> 120mg/m^2")
- Has_multiplier("epirubicin", "> 900 mg/m^2")
- Has_multiplier("Doxorubicin", "> 500 mg/m^2")
- Subsumes("anthracyclines", "epirubicin")
- OR("Doxorubicin", "liposomal doxorubicin")